Clinical trial exclusion criterion:
Died before TAVI

Entity relations:
- Has_temporal("Died", "before TAVI")